Clinical trial exclusion criterion:
Presence of active or acute AIDS-defining opportunistic infections within 12 weeks prior to study entry.

Annotated entities:
- Temporal: "acute"
- Temporal: "active"
- Condition: "AIDS-defining opportunistic infections"
- Temporal: "within 12 weeks prior to study entry"